Have, in the opinion of the investigator, evidence of alcohol, drug or solvent abuse.

The above is a clinical trial exclusion criterion. Annotated with entity spans:
Have, [Non-representable: in the opinion of the investigator], evidence of [Condition: alcohol], [Condition: drug] or [Condition: solvent abuse].